Clinical trial inclusion criterion:
Metabolic Syndrome (ATP III)

Entity relations:
- Has_value("ATP", "III")
- Subsumes("Metabolic Syndrome", "ATP")